Clinical trial exclusion criterion:
3. Have been taking corticosteroids for longer than 48 hours.

Entity relations:
- Has_temporal("corticosteroids", "longer than 48 hours")